Clinical trial exclusion criterion:
Undifferentiated, Anaplastic or Medullary Thyroid Cancer

Annotated entities:
- Condition: "Medullary Thyroid Cancer"
- Condition: "Anaplastic Thyroid Cancer"
- Condition: "Undifferentiated Thyroid Cancer"